下列關於致癌性 RNA 病毒（Oncovirus）之敘述，何者為錯？
A. 分類上屬於反轉錄病毒科（retroviridae）
B. 又叫 RNA 腫瘤病毒（RNA tumor virus）
C. 有些本身帶有致癌基因（oncogenes）
D. 有些本身不帶有致癌基因也可以致癌，例如勞斯氏肉瘤病毒（Rous sarcoma virus）

正確答案：D. 有些本身不帶有致癌基因也可以致癌，例如勞斯氏肉瘤病毒（Rous sarcoma virus）